Neurological diseases

The above is a clinical trial exclusion criterion. Annotated with entity spans:
[Condition: Neurological diseases]